Clinical trial inclusion criterion:
Resident in Scotland with a Community Health Index (CHI) number

Entity relations:
- AND("Resident", "Scotland")